Clinical trial inclusion criterion:
In addition to the subjects, prohibitting other people taking this product.

Annotated entities:
- Undefined_semantics: "In addition to the subjects, prohibitting other people taking this product"